橈骨近端（proximal radius）靠近肘關節附近，例如橈骨頸發生骨折時，最可能合併那一條神經的傷害？
A. 前骨間神經（anterior interosseous nerve）
B. 後骨間神經（posterior interosseous nerve）
C. 尺神經（ulnar nerve）
D. 淺橈神經（superficial radial nerve）

正確答案：B. 後骨間神經（posterior interosseous nerve）